Clinical trial exclusion criterion:
Life expectancy of less than 3 years, due to intercurrent disease, especially neoplastic,

Annotated entities:
- Measurement: "Life expectancy"
- Value: "less than 3 years"
- Condition: "intercurrent disease"
- Condition: "neoplastic"
- Non-representable: "due to"